Patient has had previous eradication therapy of Helicobacter pylori infection.

The above is a clinical trial exclusion criterion. Annotated with entity spans:
Patient has had [Temporal: previous] [Procedure: eradication therapy] of [Condition: Helicobacter pylori infection].